Clinical trial exclusion criterion:
Contraindication of ALBIS

Annotated entities:
- Condition: "Contraindication"
- Drug: "ALBIS"